Clinical trial exclusion criterion:
preexisting pectoral, axillar, thoracic homolateral pain

Entity relations:
- Has_qualifier("pectoral pain", "homolateral")
- OR("pectoral pain", "axillar pain", "thoracic pain")